Clinical trial exclusion criterion:
Exclusion Criteria patients: Substance abuse on a daily basis during the last 3 month or patients fulfilling the criteria of ongoing substance abuse due to ICD-10/DSM-IV/V, Treatment with antidepressant during the last 30 days, Head injury with more than 5 minutes of unconsciousness, Patients involuntarily admitted or treated, Components of metal implanted by operation, Pacemaker, Pregnancy, Severe physical illness

Annotated entities:
- Observation: "patients"
- Condition: "Substance abuse"
- Multiplier: "daily basis"
- Multiplier: "during the last 3 month"
- Qualifier: "ICD-10/DSM-IV/V"
- Condition: "substance abuse"
- Temporal: "ongoing"
- Drug: "antidepressant"
- Temporal: "during the last 30 days"
- Condition: "Head injury"
- Multiplier: "more than 5 minutes"
- Condition: "unconsciousness"
- Observation: "involuntarily admitted"
- Observation: "involuntarily treated"
- Device: "Components of metal"
- Device: "Pacemaker"
- Condition: "Pregnancy"
- Condition: "Severe physical illness"